Clinical trial inclusion criterion:
Clinical diagnosis of calculous cholecystitis.

Annotated entities:
- Condition: "calculous cholecystitis"
- Qualifier: "Clinical diagnosis"